Clinical trial exclusion criterion:
A first degree relative (for example, mother, father, brother, sister) who had a heart condition before the age of 50

Annotated entities:
- Person: "A first degree relative"
- Condition: "heart condition"
- Temporal: "before the age of 50"
- Reference_point: "age of 50"
- Person: "age"
- Value: "50"
- Person: "mother"
- Person: "father"
- Person: "brother"
- Person: "sister"